治療早產兒開放性動脈導管（patent ductus arteriosus）最適合的藥物為：
A. epinephrine
B. β-blocker
C. indomethacin
D. dopamine

正確答案：C. indomethacin